Clinical trial inclusion criterion:
Phase II: Patients must have histologically confirmed R/R NHL (as defined by WHO criteria). Patients with NHL other than diffuse large B cell lymphomas (DLBCL) must have received at least 2 prior therapies. Patients with DLBCL will be eligible if there is no available standard therapy.

Entity relations:
- Has_qualifier("NHL", "R/R")
- Has_value("histologically", "confirmed")
- Subsumes("confirmed", "WHO criteria")
- Has_negation("diffuse large B cell lymphomas (DLBCL)", "other than")
- AND("NHL", "diffuse large B cell lymphomas (DLBCL)")
- Has_temporal("therapies", "prior")
- Has_multiplier("therapies", "at least 2")
- AND("NHL", "therapies")
- Has_negation("standard therapy", "no")
- AND("DLBCL", "standard therapy")